What cellular process are okazaki fragments associated with?

Okazaki fragments are involved in DNA replication